12. Participation in an rTMS session less than two weeks ago.

The above is a clinical trial exclusion criterion. Annotated with entity spans:
[Parsing_Error: 12.] Participation in an [Procedure: rTMS session] [Temporal: less than two weeks ago].